first upper GI endoscopy procedure

The above is a clinical trial inclusion criterion. Annotated with entity spans:
[Multiplier: first] [Qualifier: upper GI] [Procedure: endoscopy procedure]